下列何種肺癌之合併症，不適用胸腔放射線治療來緩解症狀？
A. 上腔靜脈阻塞症候群（superior vena cava syndrome）
B. 大的氣道受到壓迫
C. 胸壁受侵犯引起疼痛
D. 大量肋膜積液

正確答案：D. 大量肋膜積液